Marque el tratamiento para la depresión que NO se considera “bien establecido”, por carecer de apoyo empírico suficiente, según la Asociación Americana de Psicología:
1. Terapia de solución de problemas.
2. Terapia de autocontrol.
3. Terapia cognitiva.
4. Terapia psicodinámica breve.
5. Entrenamiento en habilidades sociales.

Respuesta correcta: 4. Terapia psicodinámica breve.